What is the target of a drug pidilizumab?

Pidilizumab is a a humanised monoclonal antibody that targets programmed death-1 pathway.